Clinical trial exclusion criterion:
Known cause of apnea other than apnea of prematurity

Entity relations:
- Has_negation("apnea of prematurity", "other than")
- AND("Known cause of apnea", "apnea of prematurity")